Less than or equal to (<=) 1 previous failed embryo transfer

The above is a clinical trial inclusion criterion. Annotated with entity spans:
[Value: Less than or equal to (<=) 1] [Measurement: previous failed embryo transfer]